Clinical trial exclusion criterion:
<37 weeks gestation, H/o Cesarean Section, Multiple Gestation, Pre-eclampsia, Narcotics within 3 hours prior to labor epidural placement, Chronic Pain (as defined by chronic opiate consumption), Women who are participating in another study that will impact protocol

Annotated entities:
- Measurement: "gestation"
- Value: "<37 weeks"
- Procedure: "Cesarean Section"
- Condition: "Multiple Gestation"
- Observation: "H/o"
- Condition: "Pre-eclampsia"
- Drug: "Narcotics"
- Temporal: "within 3 hours prior to labor epidural placement"
- Procedure: "labor epidural placement"
- Reference_point: "labor epidural placement"
- Condition: "Chronic Pain"
- Multiplier: "chronic"
- Drug: "opiate"
- Competing_trial: "Women who are participating in another study that will impact protocol"